有關僵直性脊椎炎之敘述，下列何者錯誤？
A. HLA-B27陽性者較B27陰性者，易出現葡萄膜炎（uveitis）
B. HLA-B27陽性者較陰性者，家族傾向較高
C. 一般人口中，20%之HLA-B27陽性者，可出現僵直性脊椎炎
D. HLA-B27在北美之印第安人（Indians）其盛行率，遠高於臺灣原住民

正確答案：C. 一般人口中，20%之HLA-B27陽性者，可出現僵直性脊椎炎